Patients' tumor express Melan-A/MART-1 antigen.

The above is a clinical trial inclusion criterion. Annotated with entity spans:
Patients' tumor express [Observation: Melan-A]/[Observation: MART-1 antigen].